關於異位性皮膚炎（atopic dermatitis）的敘述，下列何者錯誤？
A. 嬰幼兒最常見之慢性復發性皮膚病（chronic relapsing disease），約一半的病人在一歲前發病
B. Filaggrin 基因的缺損可於所有異位性皮膚炎病童身上發現
C. 異位性皮膚炎是和第二型輔助型T細胞（T-helper type 2 cells）有關的發炎疾病，因此多數患者血中IgE會
D. 嚴重異位性皮膚炎可考慮使用口服類固醇，如長期使用，停藥時須逐漸減量，以避免反彈（rebound effect）

正確答案：B. Filaggrin 基因的缺損可於所有異位性皮膚炎病童身上發現